¿Cuál de las siguientes afirmaciones es INCORRECTA en relación a las alteraciones del equilibrio ácido-base?
1. El pH arterial se regula por la ecuación de Henderson-Hasselbach y es de 7.35-7.45.
2. La hipercapnia (aumento de la PaCO2) es consecuencia del aumento de producción de CO2.
3. La acidosis metabólica ocurre por aumento de producción endógena de ácidos, acumulación de ácidos y/o pérdida de bicarbonatos.
4. En los pacientes con acidosis láctica es frecuente encontrar una brecha o diferencia aniónica superior a 12 mmol/L.
5. El uso de soluciones alcalinizantes debe reservarse para casos de acidemias graves con ph < 7.20.

Respuesta correcta: 2. La hipercapnia (aumento de la PaCO2) es consecuencia del aumento de producción de CO2.